1. age 18-65 years, inclusive

The above is a clinical trial inclusion criterion. Annotated with entity spans:
1. [Person: age] [Value: 18-65 years, inclusive]